Clinical trial inclusion criterion:
Clinical diagnosis of chronic plaque-type psoriasis of the body

Annotated entities:
- Qualifier: "plaque-type"
- Qualifier: "chronic"
- Condition: "psoriasis of the body"